下列何者與旋後肌（supinator）由相同的神經支配？
A. 旋前圓肌（pronator teres）
B. 旋前方肌（pronator quadratus）
C. 伸拇指短肌（extensor pollicis brevis）
D. 外展拇指短肌（abductor pollicis brevis）

正確答案：C. 伸拇指短肌（extensor pollicis brevis）